下列有關 mixed lymphocyte reaction（MLR）的敘述何者錯誤？
A. MLR 可以用來偵測器官移植時，捐贈者與接受者組織不相容之情形
B. MLR 可以用來偵測 CD4+ T 細胞增生之情形
C. MLR 會加入[3H]-thymidine 來偵測 DNA 合成之情況
D. [3H]-thymidine 的量越多表示細胞增生程度越好，捐贈者的器官越容易被接受

正確答案：D. [3H]-thymidine 的量越多表示細胞增生程度越好，捐贈者的器官越容易被接受